急性硬腦膜外血腫（epidural hematoma）的病人，下列敘述何者錯誤？
A. 常合併有顱骨骨折
B. 常因是中腦膜動脈（middle meningeal artery）破裂所致
C. 預後比急性硬腦膜內血腫（acute subdural hematoma）不好
D. 約有1/3的病人到急診處呈昏迷狀態

正確答案：C. 預後比急性硬腦膜內血腫（acute subdural hematoma）不好